一位3個月大的嬰兒因抽搐、嘔吐、意識不清送來急診處，檢查血液發現高血氨（hyperammonemia）、血中瓜胺酸（citrulline）低下，尿中orotic acid亦降低。該病患體內最可能缺乏何者酵素？
A. Carbamylphosphate synthetase（CPS）
B. Ornithine transcarbamylase（OTC）
C. Argininosuccinate synthetase
D. Argininosuccinate lyase

正確答案：A. Carbamylphosphate synthetase（CPS）